Clinical trial exclusion criterion:
History of allergy or intolerance to any of the study drugs

Annotated entities:
- Condition: "allergy"
- Temporal: "History"
- Condition: "intolerance"
- Drug: "study drugs"